關於嬰幼兒感染砂眼披衣菌（Chlamydia trachomatis）肺炎之敘述，下列何者較正確？
A. 罹患砂眼披衣菌母親且未接受治療，約九成其新生兒會得到砂眼披衣菌肺炎
B. 通常新生兒出生後1週內會有明顯肺炎症狀
C. 相對呼吸道融合病毒感染，砂眼披衣菌肺炎較容易發燒及喘鳴聲（Wheezing）
D. 砂眼披衣菌感染後，血液中嗜伊紅白血球會增加（eosinophils > 400 cells/μL）

正確答案：D. 砂眼披衣菌感染後，血液中嗜伊紅白血球會增加（eosinophils > 400 cells/μL）